Willing to adhere to a specific treatment duration determined by initial response to treatment and subsequent randomization

The above is a clinical trial inclusion criterion. Annotated with entity spans:
[Mood: Willing to] [Non-representable: adhere to a specific treatment duration determined by initial response to treatment and subsequent randomization]